CHB patients who had received single NAs for more than 12 months.

The above is a clinical trial inclusion criterion. Annotated with entity spans:
[Condition: CHB] patients who had received [Qualifier: single] [Drug: NAs] for [Temporal: more than 12 months].